Clinical trial exclusion criterion:
Any disease or condition that interferes with completion of initial or follow-up assessments

Annotated entities:
- Condition: "disease"
- Condition: "condition"
- Qualifier: "interferes with completion of initial or follow-up assessments"